Allergic to penicillin

The above is a clinical trial exclusion criterion. Annotated with entity spans:
[Condition: Allergic] to [Drug: penicillin]